當腎臟血管肌肉脂肪瘤（angiomyolipoma）小於幾公分時可採定期追蹤，不需手術？
A. 4 公分
B. 6 公分
C. 8 公分
D. 10 公分

正確答案：A. 4 公分